Patients with hypertrophic occlusive myocardiopathy, severe occlusive coronary artery disease, aortic stenosis, hemodynamically significant aortic valve or mitral valve stenosis

The above is a clinical trial exclusion criterion. Annotated with entity spans:
Patients with [Condition: hypertrophic occlusive myocardiopathy], [Qualifier: severe] [Condition: occlusive coronary artery disease], [Condition: aortic stenosis], [Qualifier: hemodynamically significant] [Condition: aortic valve] or [Condition: mitral valve stenosis]